At least 3 urgency episodes per 3-day diary.

The above is a clinical trial inclusion criterion. Annotated with entity spans:
[Multiplier: At least 3] [Condition: urgency episodes] per 3-day diary.